Clinical trial exclusion criterion:
Presence of acute fracture

Entity relations:
- Has_qualifier("fracture", "acute")